Clinical trial inclusion criteria:
Methadone-maintained cocaine-dependent patients use between 1g to 2g a day; 1 to 3 times a week

Annotated entities:
- Drug: "Methadone"
- Condition: "cocaine-dependent"
- Multiplier: "1g to 2g a day"
- Multiplier: "1 to 3 times a week"
- Qualifier: "Methadone-maintained"